Clinical trial inclusion criteria:
diagnosed any form of MS (relapsing remitting, primary progressive, secondary progressive), any EDSS (expanded stability status scale) score

Annotated entities:
- Condition: "MS"
- Qualifier: "relapsing remitting"
- Qualifier: "primary progressive"
- Qualifier: "secondary progressive"
- Qualifier: "any form"
- Value: "any"
- Measurement: "score EDSS"
- Measurement: "expanded stability status scale"